Clinical trial exclusion criterion:
History of rhegmatogenous retinal detachment, retinal tear(s), or traction retinal detachments in the study eye.

Annotated entities:
- Condition: "rhegmatogenous retinal detachment"
- Temporal: "History of"
- Condition: "retinal tear(s)"
- Condition: "traction retinal detachments"
- Qualifier: "in the study eye"